Clinical trial exclusion criterion:
Patients with signs or symptoms of SVC syndrome, or hepatic cirrhosis not felt due to passive congestion from TR.

Annotated entities:
- Condition: "SVC syndrome"
- Condition: "hepatic cirrhosis"
- Condition: "passive congestion from TR"